Clinical trial exclusion criterion:
Any contraindication to neuraxial anesthesia (history of neurologic disease (e.g., multiple sclerosis, spinal stenosis, central or peripheral neuropathy)

Entity relations:
- Subsumes("neurologic disease", "multiple sclerosis")
- Has_temporal("neurologic disease", "history")
- AND("contraindication", "neuraxial anesthesia")
- Subsumes("contraindication", "neurologic disease")
- OR("multiple sclerosis", "central neuropathy", "spinal stenosis", "peripheral neuropathy")